Clinical trial exclusion criterion:
Other diseases/abnormalities: Any life-threatening condition with life expectancy <3 years, other than vascular disease or COPD, that might prevent the subject from completing the study.

Entity relations:
- Has_value("life expectancy", "<3 years")
- Has_context("life-threatening condition", "life expectancy")
- Has_negation("vascular disease", "other than")
- AND("life-threatening condition", "vascular disease")
- OR("vascular disease", "COPD")